List all approved indications for Glivec

CML - blast crisis, in accelerated phase, and in chronic phase after interferon failure or intolerance.  Glivec received orphan drug status from the U.S. Food and Drug Administration (FDA) Office of Orphan Products Development on January 31, 2001, and accelerated approval from the FDA for the above three indications on May 10, 2001.

Gastrointestinal stromal tumor (GIST
Treatment with adjuvant imatinib following surgical resection of localized Kit-positive GIST
 In locally advanced inoperable patients and metastatic patients, Imatinib is the standard treatment.